known or suspected bowel obstruction

The above is a clinical trial exclusion criterion. Annotated with entity spans:
[Mood: known] or [Mood: suspected] [Condition: bowel obstruction]